Clinical trial exclusion criterion:
Uncontrolled HCC, malignancy or decompensated liver cirrhosis (CTP score = 7).

Entity relations:
- Has_qualifier("liver cirrhosis", "decompensated")
- Has_qualifier("HCC", "Uncontrolled")
- Has_value("CTP score", "= 7")
- OR("HCC", "malignancy", "liver cirrhosis")